obstructive sleep apnea

The above is a clinical trial exclusion criterion. Annotated with entity spans:
[Condition: obstructive sleep apnea]